Clinical trial exclusion criteria:
Past history of hypersensitivity to the study drug;
Diagnosed diabetes;
Severe liver disease (including ALT or AST=2.5-fold the normal upper limit), biliary obstruction;
Ongoing treatment with cyclosporine within 2 weeks;
Renal dysfunction, including endogenous creatinine clearance male<120ml/min, female<105ml/min, serum creatinine=2mg/dl (186umol/L), Renal function progressive decline, GFR<30ml•min-1•1.73m-2;
Diagnosed or past history of ASCVD (including ACS, SCAD, revascularization, ICM, ischemic stroke, TIA, PASD, etc.
SBP=180mmHg, or DBP=110mmHg;
Ongoing treatment with Beta blockers, Diuretic;
Secondary hypertension, including SAS, PA, RAS, pheochromocytoma, Cushing's syndrome, aorta diseases, drug induced hypertension;
Ongoing treatment with statins, fibrates, and/or cation exchange resins within 2 weeks;
Pancreatic disease;
History of gastrectomy, short bowel syndrome;
Ongoing hormone replacement therapy;
Diagnosed or suspected malignant tumor;
Familial hypercholesterolemia;
Any diseases may limit the efficacy or safety of the study;
Pregnant or possibly pregnant woman, or breastfeeding woman, or woman who wishes to become pregnant during study participation;
IFG impaired fast glucose, FPG fasting plasma glucose, IGT impaired glucose tolerance, OGTT oral glucose tolerance test, PG plasma glucose, HbA1C hemoglobin A1C, LDL-C low-density lipoprotein cholesterol, TG triglycerides, SBP systolic blood pressure, DBP diastolic blood pressure, ALT alanine aminotransferase, AST aspartate aminotransferase, GFR glomerular filtration rate, ASCVD arteriosclerotic cardiovascular disease, ACS acute coronary syndrome, SCAD stable coronary artery disease, ICM ischemic cardiomyopathy, TIA transient ischemic attack, PASD peripheral atherosclerotic disease, SAS sleep apnea syndrome, PA primary aldosteronism, RAS renal arterial stenosis

Annotated entities:
- Condition: "hypersensitivity"
- Drug: "study drug"
- Condition: "diabetes"
- Condition: "liver disease"
- Qualifier: "Severe"
- Measurement: "AST"
- Measurement: "ALT"
- Value: "=2.5-fold the normal upper limit"
- Condition: "biliary obstruction"
- Drug: "cyclosporine"
- Procedure: "treatment"
- Temporal: "Ongoing"
- Temporal: "within 2 weeks"
- Condition: "Renal dysfunction"
- Measurement: "endogenous creatinine clearance"
- Person: "male"
- Person: "female"
- Value: "<105ml/min"
- Value: "<120ml/min"
- Measurement: "serum creatinine"
- Value: "=2mg/dl"
- Value: "186umol/L"
- Measurement: "Renal function"
- Value: "progressive decline"
- Measurement: "GFR"
- Value: "<30ml•min-1•1.73m-2"
- Condition: "ASCVD"
- Condition: "ACS"
- Condition: "SCAD"
- Procedure: "revascularization"
- Condition: "ICM"
- Condition: "ischemic stroke"
- Condition: "TIA"
- Condition: "PASD"
- Measurement: "SBP"
- Measurement: "DBP"
- Value: "=180mmHg"
- Value: "=110mmHg"
- Drug: "Beta blockers"
- Temporal: "Ongoing"
- Procedure: "treatment"
- Drug: "Diuretic"
- Condition: "Secondary hypertension"
- Condition: "SAS"
- Condition: "PA"
- Condition: "RAS"
- Condition: "pheochromocytoma"
- Condition: "Cushing's syndrome"
- Condition: "aorta diseases"
- Condition: "hypertension"
- Qualifier: "drug induced"
- Drug: "statins"
- Drug: "fibrates"
- Temporal: "Ongoing"
- Procedure: "treatment"
- Drug: "cation exchange resins"
- Temporal: "within 2 weeks"
- Condition: "Pancreatic disease"
- Procedure: "gastrectomy"
- Condition: "short bowel syndrome"
- Temporal: "History"
- Temporal: "Ongoing"
- Procedure: "hormone replacement therapy"
- Condition: "malignant tumor"
- Mood: "suspected"
- Mood: "Diagnosed"
- Condition: "Familial hypercholesterolemia"
- Non-query-able: "Any diseases may limit the efficacy or safety of the study"
- Pregnancy_considerations: "Pregnant or possibly pregnant woman, or breastfeeding woman, or woman who wishes to become pregnant during study participation"
- Non-representable: "IFG impaired fast glucose, FPG fasting plasma glucose, IGT impaired glucose tolerance, OGTT oral glucose tolerance test, PG plasma glucose, HbA1C hemoglobin A1C, LDL-C low-density lipoprotein cholesterol, TG triglycerides, SBP systolic blood pressure, DBP diastolic blood pressure, ALT alanine aminotransferase, AST aspartate aminotransferase, GFR glomerular filtration rate, ASCVD arteriosclerotic cardiovascular disease, ACS acute coronary syndrome, SCAD stable coronary artery disease, ICM ischemic cardiomyopathy, TIA transient ischemic attack, PASD peripheral atherosclerotic disease, SAS sleep apnea syndrome, PA primary aldosteronism, RAS renal arterial stenosis"